以下何者是主動脈氣球幫浦（intra-aortic balloon pump）之禁忌症？
A. AR（aortic regurgitation）
B. MR（mitral regurgitation）
C. PR（pulmonary regurgitation）
D. TR（tricuspid regurgitation）

正確答案：A. AR（aortic regurgitation）